=3 episodes of VT treated with antitachycardia pacing (ATP), at least one of which was symptomatic

The above is a clinical trial inclusion criterion. Annotated with entity spans:
=[Multiplier: 3 episodes] of [Condition: VT] treated with [Procedure: antitachycardia pacing] ([Procedure: ATP]), [Multiplier: at least one] of which was [Qualifier: symptomatic]